Which biomarkers are currently used for Duchenne Muscular Dystrophy?

MRI, fat fraction MRI, MRI mean T2, malate dehydrogenase 2 are some biomarkers that are used for DMD.